Implanted cardiac pacemaker of defibrillator

The above is a clinical trial exclusion criterion. Annotated with entity spans:
Implanted [Device: cardiac pacemaker] of [Device: defibrillator]